新生兒斜頸（Torticollis）常伴隨下列那種關節的異常？
A. 肩關節
B. 肘關節
C. 髖關節
D. 膝關節

正確答案：C. 髖關節